河川中所產生的優氧化（eutrophication）作用，主要是那一些物質所引起？
A. 氯鉀
B. 氮磷
C. 鈉鋇
D. 氨硫

正確答案：B. 氮磷